Malignant tumor

The above is a clinical trial exclusion criterion. Annotated with entity spans:
[Condition: Malignant tumor]